Clinical trial inclusion criterion:
Willing and capable of providing informed consent

Annotated entities:
- Informed_consent: "Willing and capable of providing informed consent"